嬰兒期發現的陰道惡性腫瘤，最常見的為何？
A. Squamous cell carcinoma
B. Malignant melanoma
C. Adenocarcinoma
D. Botryoid rhabdomyosarcoma

正確答案：D. Botryoid rhabdomyosarcoma